Clinical trial exclusion criterion:
Statins (dose must be ≤ half the maximum dose; must be on a stable dose ≥3 months);

Annotated entities:
- Drug: "Statins"
- Multiplier: "≤ half the maximum dose"
- Qualifier: "stable dose"
- Temporal: "≥3 months"